Clinical trial exclusion criterion:
Congenital adrenal hyperplasia (17-OH-progesterone> 2.5 ng / mL)

Annotated entities:
- Condition: "Congenital adrenal hyperplasia"
- Measurement: "17-OH-progesterone"
- Value: "> 2.5 ng / mL"